吳小妹是一位國小 6 年級學生，7 天前，右手突然發生不自主的亂動，她無法拿筷子吃飯。雙手平舉時，整隻手臂一直舞動不停無法控制，但是右手力量無減弱，感覺也無異常，身體理學檢查顯示有心雜音。紅血球沉降速率（ESR）升高。最有可能的臨床診斷是：
A. 亨丁頓舞蹈症（Huntington chorea）
B. 席登罕氏舞蹈症（Sydenham chorea）
C. 中風性半邊舞蹈症
D. 高甲狀腺亢進舞蹈症

正確答案：B. 席登罕氏舞蹈症（Sydenham chorea）